最常見的持續性心律不整為何？
A. 上心室性心搏過速（supraventricular tachycardia）
B. 心室性心搏過速（ventricular tachycardia）
C. 心房顫動（atrial fibrillation）
D. 心房撲動（atrial flutter）

正確答案：C. 心房顫動（atrial fibrillation）